MMR 為混合疫苗，不能對抗下列何種病毒？
A. 腮腺炎病毒（Mumps virus）
B. 麻疹病毒（Measles virus）
C. 輪狀病毒（Rotavirus）
D. 德國麻疹病毒（Rubella virus）

正確答案：C. 輪狀病毒（Rotavirus）